La deshidrogenación de alquilbencenos no es un método de laboratorio conveniente, pero se usa en forma industrial para convertir etilbenceno en:
1. Cumeno.
2. Tolueno.
3. Estireno.
4. Fenol.
5. Naftaleno.

Respuesta correcta: 3. Estireno.